Una de las siguientes afirmaciones sobre la epidemiología y el pronóstico de la insuficiencia cardiaca es INCORRECTA. Señálela.
1. Entre el 60 y el 70% de los pacientes fallecen en los primeros 5 años tras establecerse el diagnóstico de insuficiencia cardiaca.
2. La situación funcional del paciente con insuficiencia cardiaca es la que mejor se correlaciona con la expectativa de supervivencia.
3. La disfunción diastólica predomina en mujeres de edad avanzada con historia de hipertensión crónica.
4. La insuficiencia cardiaca por disfunción sistólica suele objetivarse en pacientes varones afectos de cardiopatía isquémica.
5. La prevalencia de la insuficiencia cardiaca está reduciéndose en la última década gracias al mejor control de los factores de riesgo cardiovascular.

Respuesta correcta: 5. La prevalencia de la insuficiencia cardiaca está reduciéndose en la última década gracias al mejor control de los factores de riesgo cardiovascular.